Un hombre de 62 años con una diabetes mellitus tipo 2 de 10 años de evolución realiza tratamiento con metformina y sitagliptina. Hace ejercicio físico escaso y realiza una dieta adecuada. En los últimos 6 meses ha perdido peso y tiene más astenia. Sus controles glucémicos se han deteriorado pasando de glucemias basales de 110-140 mg/dl a glucemias de 170-200 mg/dl, así como su hemoglobina glicosilada que ha pasado de 7,1 a 8,5%. La medida terapéutica más adecuada a realizar es:
1. Aumentar la ingesta de proteínas e hidratos de carbono de cadena larga en la dieta para mejorar la astenia y la pérdida de peso.
2. Asociar al tratamiento una dosis de insulina basal.
3. Asociar al tratamiento acarbosa.
4. Sustituir la sitagliptina por pioglitazona.
5. Sustituir la metformina por glimepirida.

Respuesta correcta: 2. Asociar al tratamiento una dosis de insulina basal.